Confirmed diagnosis (clinical and histological features) of Hailey Hailey or Darier diseases.

The above is a clinical trial inclusion criterion. Annotated with entity spans:
Confirmed diagnosis (clinical and [Procedure: histological] features) of [Condition: Hailey Hailey] or [Condition: Darier disease]s.